BMI <18 and> 35 kg / m2

The above is a clinical trial exclusion criterion. Annotated with entity spans:
[Measurement: BMI] [Value: <18 and> 35 kg / m2]